En la evaluación psicológica, los autorregistros podemos considerarlos como instrumentos:
1. Estructurados.
2. Semiestructurados.
3. No estructurados.
4. Cuasi-experimentales.

Respuesta correcta: 2. Semiestructurados.